Clinical trial inclusion criterion:
Patients presenting with ST-elevation acute myocardial infarction (STEMI) within 12 hours of their symptom onset in whom TIMI-3 flow was established in infarct related artery (IRA) after balloon angioplasty or thrombectomy.

Entity relations:
- Has_temporal("ST-elevation acute myocardial infarction (STEMI)", "within 12 hours of their symptom onset")
- Has_index("within 12 hours of their symptom onset", "their symptom onset")
- Has_qualifier("TIMI-3 flow was established", "infarct related artery (IRA)")
- Has_index("after balloon angioplasty or thrombectomy", "balloon angioplasty or thrombectomy")
- multi("balloon angioplasty or thrombectomy", "balloon angioplasty")
- Has_temporal("TIMI-3 flow was established", "after balloon angioplasty or thrombectomy")
- OR("balloon angioplasty", "thrombectomy")